Clinical trial inclusion criterion:
10. Women of child-bearing potential must have a negative pregnancy test

Annotated entities:
- Parsing_Error: "10."
- Condition: "child-bearing potential"
- Person: "Women"
- Measurement: "pregnancy test"
- Value: "negative"